Clinical diagnosis of chronic or acute alcoholism

The above is a clinical trial exclusion criterion. Annotated with entity spans:
[Qualifier: Clinical diagnosis] of [Qualifier: chronic] or [Qualifier: acute] [Condition: alcoholism]